What is the basis of the capture Hi-C experimental protocol?

Chromosome conformation capture implemented in Hi-C allows for genome-wide agnostic characterization of chromatin contacts.